Evidence of type 1 diabetes and diabetics requiring insulin therapy.

The above is a clinical trial exclusion criterion. Annotated with entity spans:
Evidence of [Condition: type 1 diabetes] and [Condition: diabetics] [Qualifier: requiring insulin therapy].